Clinical trial inclusion criterion:
Patient eligible for transradial and transfemoral primary percutaneous coronary intervention, being pre-requisites: (a) familiarity of the operator with the radial and femoral techniques using vascular closure devices, (b) agreement of the operator to use the access route determined by the randomization process.

Annotated entities:
- Qualifier: "transradial"
- Qualifier: "transfemoral"
- Qualifier: "primary"
- Procedure: "percutaneous coronary intervention"
- Mood: "eligible for"
- Non-representable: "being pre-requisites: (a) familiarity of the operator with the radial and femoral techniques using vascular closure devices, (b) agreement of the operator to use the access route determined by the randomization process."